Clinical trial inclusion criterion:
Signed informed consent;

Annotated entities:
- Non-query-able: "Signed informed consent;"